Clinical trial exclusion criterion:
Pain at rest or critical limb ischemia

Entity relations:
- OR("Pain at rest", "critical limb ischemia")